Clinical trial exclusion criterion:
cognitive impairment (Mini-Mental Status Examination score: illiterate 13 points; elementary and middle school 18 points; and high-school 26 points; or inability to respond to verbal command);

Entity relations:
- Has_value("elementary", "18 points")
- Has_value("illiterate", "13 points")
- Has_value("high-school", "26 points")
- Has_context("Mini-Mental Status Examination score", "illiterate")
- Subsumes("cognitive impairment", "Mini-Mental Status Examination score")
- OR("elementary", "middle school")
- OR("illiterate", "high-school", "inability to respond to verbal command", "elementary")